Clinical trial exclusion criterion:
Known hypersensitivity to the trial treatment(s) or diluents (when applicable), including placebo or other comparator drug(s).

Entity relations:
- AND("hypersensitivity", "trial treatment(s)")
- Has_qualifier("comparator drug(s)", "other")
- Subsumes("hypersensitivity", "placebo")
- OR("trial treatment(s)", "trial diluents")
- OR("placebo", "comparator drug(s)")